Clinical trial inclusion criterion:
Patients who have normal liver function and renal function.

Entity relations:
- Has_qualifier("liver function", "normal")
- Has_qualifier("renal function", "normal")